支配闊頸肌（platysma m.）的神經纖維源自：
A. 副神經
B. 鎖骨上神經
C. 頸橫神經
D. ）面神經

正確答案：D. ）面神經